Indica cuál de los siguientes será el diagnóstico más probable si un individuo posee un déficit de lipoproteína lipasa:
1. Dislipemia tipo I.
2. Dislipemia tipo IIa.
3. Dislipemia tipo III.
4. Abetalipoproteinemia.
5. Enfermedad de Tangier.

Respuesta correcta: 1. Dislipemia tipo I.